unresectable synchronous metastases

The above is a clinical trial inclusion criterion. Annotated with entity spans:
[Qualifier: unresectable] [Qualifier: synchronous] [Condition: metastases]